雞肉必須煮熟食用，是屬於「食品安全管制系統」（HACCP）的那個原則？
A. 危害評估
B. 決定管制重點
C. 針對管制重點設置管制程序與標準
D. 建立管制監測系統

正確答案：B. 決定管制重點